¿Qué región cerebral se ha relacionado con el inicio de la ingesta y con la reducción del metabolismo?:
1. El núcleo ventromedial del hipotálamo.
2. El núcleo pulvinar del tálamo.
3. El área preóptica ventrolateral del hipotálamo.
4. Distintas zonas del hipotálamo (lateral, núcleo arqueado, núcleo paraventricular…).

Respuesta correcta: 4. Distintas zonas del hipotálamo (lateral, núcleo arqueado, núcleo paraventricular…).